下列那一個大腦運動區位於體感覺區的後方，並且負責眼手的協調？
A. primary motor cortex
B. premotor cortex
C. supplementary motor cortex
D. parietal-lobe association cortex

正確答案：D. parietal-lobe association cortex